Clinical trial exclusion criterion:
Patients with a body mass index (BMI) > 40

Annotated entities:
- Measurement: "body mass index"
- Measurement: "BMI"
- Value: "> 40"